一位 8 歲病童因鼻咽部腫瘤無法全部切除，僅能進行切片檢查，經血液病理專家診斷為 Burkitt 氏淋巴瘤，其他身體檢查發現無其他淋巴腺腫大，肝、脾沒有腫大，骨頭、骨髓、脊髓液及血液檢查均正常，請問他的癌細胞屬性及淋巴瘤臨床病期為何？
A. B 淋巴細胞 I 期
B. T 淋巴細胞 I 期
C. B 淋巴細胞 II 期
D. T 淋巴細胞 II 期

正確答案：A. B 淋巴細胞 I 期